Clinical trial inclusion criterion:
Male and females between ages 18-85 years

Annotated entities:
- Person: "females"
- Person: "Male"
- Value: "between 18-85 years"
- Person: "ages"